Clinical trial exclusion criterion:
Patient works for OOO "NPF "MATERIA MEDICA HOLDING" (i.e., is the company's employee, temporary contract worker or appointed official responsible for carrying out the research or their immediate family).

Annotated entities:
- Person: "works for OOO "NPF "MATERIA MEDICA HOLDING""
- Person: "company's employee"
- Person: "temporary contract worker"
- Person: "appointed official"
- Observation: "responsible for carrying out the research or their immediate family"